有關蜱媒介人巴貝氏原蟲病（human babesiosis）之敘述，下列何者錯誤？
A. 巴貝氏原蟲（Babesia）感染宿主後主要寄生在紅血球內
B. 患者常呈現無症狀感染（asymptomatic infection）之高度寄生蟲血症（heavy parasitemia）
C. 感染致死之病例通常發生在脾臟切除（splenectomized）病人
D. 臨床感染診斷則以血液抹片配合免疫螢光抗體試	（IFA）為主

正確答案：B. 患者常呈現無症狀感染（asymptomatic infection）之高度寄生蟲血症（heavy parasitemia）